某一老人照護中心發生群聚感染，有25位長者出現水樣下痢、噁心及嘔吐等，症狀持續12至60小時不等。此最可能由下列何種病毒所引起？
A. 巨細胞病毒（Cytomegalovirus）
B. 漢坦病毒（Hantaan virus）
C. 諾羅病毒（Norovirus）
D. B型肝炎病毒（Hepatitis B virus）

正確答案：C. 諾羅病毒（Norovirus）